關於個人行為與醫療資源分配之關係，下列何者並非臺灣現行之規定？
A. 因為酒癮者必須為其過度飲酒負責，臺灣全民健康保險不給付酒癮勒戒之治療
B. 因為酒癮患者必須為其過度飲酒行為導致末期肝衰竭負責，若需接受肝臟移植時，其參與分配順位應為末位
C. 因為全民健康保險之目的在於恢復或保持健康，不在於協助人尋求完美，所以全民健康保險不給付美容外科手術
D. 即使自殺者吞服農藥企圖自殺乃是自己的行為，全民健康保險仍給付因自殺行為所產生傷害之醫療費用

正確答案：B. 因為酒癮患者必須為其過度飲酒行為導致末期肝衰竭負責，若需接受肝臟移植時，其參與分配順位應為末位